History of tuberculosis , presence of active tuberculosis, or latent tuberculosis

The above is a clinical trial exclusion criterion. Annotated with entity spans:
[Temporal: History] of [Procedure: tuberculosis] , presence of [Qualifier: active] [Procedure: tuberculosis], or [Qualifier: latent] [Procedure: tuberculosis]